Carbamazepine, phenytoin, phenobarbital, oxcarbazepine

The above is a clinical trial exclusion criterion. Annotated with entity spans:
[Drug: Carbamazepine], [Drug: phenytoin], [Drug: phenobarbital], [Drug: oxcarbazepine]